Clopidogrel之拮抗血小板凝集作用經由何種機制？
A. 提升血小板胞內之c-AMP
B. ADP receptor之拮抗
C. Fibrinogen receptor（即醣蛋白IIb/IIIa）之拮抗
D. Thromboxane receptor之拮抗

正確答案：B. ADP receptor之拮抗